Systemic sclerosis patients:

The above is a clinical trial exclusion criterion. Annotated with entity spans:
[Condition: Systemic sclerosis] patients: